Clinical trial inclusion criterion:
Subjects who are able and willing to undergo elective cardiac magnetic resonance (MR) scanning without sedation (MRI-group)

Annotated entities:
- Mood: "willing to undergo"
- Qualifier: "elective"
- Procedure: "cardiac magnetic resonance scanning"
- Procedure: "MR"
- Qualifier: "without sedation"